Left ventricular ejection fraction <40%.

The above is a clinical trial exclusion criterion. Annotated with entity spans:
[Measurement: Left ventricular ejection fraction] [Value: <40%].